Clinical trial exclusion criterion:
Total cholesterol >280 mg/dL

Entity relations:
- Has_value("Total cholesterol", ">280 mg/dL")